Surgery and/or previous ocular pathology (presence of scar/change in the cornea, glaucoma, retinopathies, etc.).

The above is a clinical trial exclusion criterion. Annotated with entity spans:
[Procedure: Surgery] and/or [Temporal: previous] [Condition: ocular pathology] (presence of [Condition: scar]/[Observation: change in the cornea], [Condition: glaucoma], [Condition: retinopathies], etc.).